Clinical trial exclusion criterion:
Unable to participate for administrative reasons

Entity relations:
- Has_qualifier("Unable to participate", "administrative reasons")